Clinical trial exclusion criteria:
Women of child-bearing potential that do not practice adequate contraception.
Pregnant or lactating.
Received more than one primary chemotherapy regimen.
Concomitant or previous malignancies with the exception of adequately treated basal cell or squamous cell skin cancer, in situ cervical cancer, incidental carcinoid, or other cancer from which the patient has been disease free for 5 years.
Active uncontrolled infection requiring antibiotics.
Concurrent severe medical problems unrelated to the malignancy which would limit full compliance with the study.
Received radiation to more than 10% of bone.
Prior treatment with topotecan or gemcitabine.
Hypersensitivity to camptothecin or nucleoside analogues.
Use of an investigational agent within 30 days.

Annotated entities:
- Person: "Women"
- Condition: "child-bearing potential"
- Negation: "do not"
- Procedure: "adequate contraception"
- Condition: "Pregnant"
- Condition: "lactating"
- Drug: "primary chemotherapy regimen"
- Multiplier: "more than one"
- Condition: "malignancies"
- Qualifier: "previous"
- Qualifier: "Concomitant"
- Condition: "basal cell skin cancer"
- Condition: "squamous cell skin cancer"
- Condition: "in situ cervical cancer"
- Condition: "incidental carcinoid"
- Condition: "other cancer"
- Negation: "the exception of"
- Qualifier: "adequately treated"
- Temporal: "for 5 years"
- Qualifier: "has been disease free"
- Condition: "infection"
- Qualifier: "Active uncontrolled"
- Drug: "antibiotics"
- Temporal: "Concurrent"
- Qualifier: "severe"
- Condition: "medical problems"
- Qualifier: "limit full compliance with the study"
- Qualifier: "unrelated to the malignancy"
- Condition: "malignancy"
- Procedure: "radiation"
- Value: "more than 10%"
- Qualifier: "bone"
- Drug: "topotecan"
- Drug: "gemcitabine"
- Observation: "treatment"
- Temporal: "Prior"
- Condition: "Hypersensitivity"
- Drug: "camptothecin"
- Drug: "nucleoside analogues"
- Drug: "investigational agent"
- Temporal: "within 30 days"